Clinical trial inclusion criteria:
Age range: 14 to 65 years-old;
Clinically diagnosed of Port-wine Stain;
Patients receiving hemoporfin based upon the clinical judgment of the investigator;
Written informed consent signed and agreed to receive periodic follow-up

Annotated entities:
- Person: "Age"
- Value: "14 to 65 years-old"
- Condition: "Port-wine Stain"
- Drug: "hemoporfin"
- Post-eligibility: "Written informed consent signed and agreed to receive periodic follow-up"